Clinical trial inclusion criterion:
LA size < 65

Entity relations:
- Has_value("LA size", "< 65")